由氣管給予肺表面張力素（surfactant）的治療效果，是依賴它能否迅速地和均勻地在肺泡中被吸附和傳播。下列那一狀況的肺表面張力素是最有效率的分布？
A. 在使用呼吸器一段時間後
B. 出生時仍有胎兒肺液體時
C. 緩慢速率地注入
D. 以aerosol的方式給予

正確答案：B. 出生時仍有胎兒肺液體時